Clinical trial inclusion criterion:
Smoke at least 10 cigarettes daily

Entity relations:
- Has_value("Smoke", "at least 10 cigarettes daily")